Clinical trial exclusion criterion:
Probable noncompliance

Annotated entities:
- Qualifier: "Probable"
- Condition: "noncompliance"